Unable to use the ELLIPTA inhaler and peak flow meter correctly.

The above is a clinical trial exclusion criterion. Annotated with entity spans:
[Condition: Unable to use the ELLIPTA inhaler and peak flow meter correctly.]